某中風病人合併失語症（aphasia），不會講話也聽不懂，但是他的覆述口語（repetition）能力卻完全正常，該病人屬於下列那一種失語症？
A. 布羅卡（Broca）失語症
B. 渥尼卡（Wernicke）失語症
C. 傳導型（conduction）失語症
D. 經皮質型（transcortical）失語症

正確答案：D. 經皮質型（transcortical）失語症